Cuando la magnitud de un error aumenta con la concentración de la muestra, se denomina
1. Error constante.
2. Error proporcional.
3. Error al azar.
4. Sesgo.

Respuesta correcta: 2. Error proporcional.